Uno de los componente básicos que suelen incluir todos los programas de Entrenamiento en Habilidades Sociales es:
1. Imaginación Racional Emotiva.
2. Técnicas de control estimular.
3. Toma de perspectiva.
4. Ensayo de conducta.
5. Contratos de contingencias.

Respuesta correcta: 4. Ensayo de conducta.